The patient is willing and able to complete protocol required baseline assessments and procedures

The above is a clinical trial inclusion criterion. Annotated with entity spans:
The patient is [Observation: willing and able to complete protocol] required [Procedure: baseline assessments] and procedures